Where is the yeast transpozable element Ty3 preferentially inserted?

The yeast transpozable element Ty3 is preferentially located in the promoter region of genes encoding ribosomal proteins.